do not speak English

The above is a clinical trial exclusion criterion. Annotated with entity spans:
do [Negation: not] [Observation: speak English]